Clinical trial inclusion criterion:
Currently on long term TDF anti-HBV treatment,

Annotated entities:
- Drug: "TDF"
- Procedure: "TDF anti-HBV treatment"
- Multiplier: "long term"
- Condition: "HBV"